Clinical trial exclusion criterion:
Renal insufficiency defined as creatinine clearance < 60 mL/min

Annotated entities:
- Condition: "Renal insufficiency"
- Measurement: "creatinine clearance"
- Value: "< 60 mL/min"